a history of non-standard treatment(chemotherapy or surgery)

The above is a clinical trial exclusion criterion. Annotated with entity spans:
a [Temporal: history] of [Procedure: non-standard treatment]([Procedure: chemotherapy] or [Procedure: surgery])